Written informed consent and/or, written informed assent as required

The above is a clinical trial inclusion criterion. Annotated with entity spans:
[Observation: Written informed consent] and/or, [Observation: written informed assent] as required